Clinical trial exclusion criterion:
Any other condition that the investigator believes might put the participant at risk

Annotated entities:
- Post-eligibility: "Any other condition that the investigator believes might put the participant at risk"